Clinical trial exclusion criterion:
Blind patients

Annotated entities:
- Condition: "Blind"